Clinical trial exclusion criterion:
Unable to attend scheduled visits (eg, lack of transportation) or lack of a caregiver or guardian to supervise study participation

Entity relations:
- Subsumes("Unable to attend scheduled visits", "lack of transportation")
- OR("Unable to attend scheduled visits", "lack of a caregiver", "lack of guardian")